Not having taken the direct oral anticoagulant on the day of the extraction

The above is a clinical trial inclusion criterion. Annotated with entity spans:
[Negation: Not] having taken the direct [Qualifier: oral] [Drug: anticoagulant] [Temporal: on the day of the extraction]